AZT（3'-azido-2',3'-dideoxythymidine）臨床上被用為治療感染HIV-1病毒之病患。主要作用為下列何者？
A. 反轉錄酶（reverse transcriptase）的不可逆抑制劑
B. DNA聚合酶甲型（DNA polymerase α）的競爭性抑制劑
C. 做為反轉錄酶（reverse transcriptase）催化DNA合成反應中的鏈終結者（chain terminator）
D. RNase A活性的抑制劑

正確答案：C. 做為反轉錄酶（reverse transcriptase）催化DNA合成反應中的鏈終結者（chain terminator）